Clinical trial exclusion criterion:
4. Incapable of completing bowel preparation，such as dysphagia, allergy to purgatives, or impaired mental status, etc.

Entity relations:
- AND("allergy", "purgatives")
- AND("Incapable of completing bowel preparation", "dysphagia")
- OR("dysphagia", "allergy", "impaired mental status")